環保署公布之空氣污染指標值（PSI），乃是將測得之各項污染物濃度換算成副指標，再以其中何者公布之？
A. 所有污染物副指標中最大值
B. 所有污染物副指標中最小值
C. 所有污染物副指標之總和
D. 所有污染物副指標之平均

正確答案：A. 所有污染物副指標中最大值